Clinical trial exclusion criterion:
Known hypersensitivity to bovine protein

Entity relations:
- AND("hypersensitivity", "bovine protein")